下列那一項疾病，不適合用冷凍手術（cryosurgery）治療？
A. 蕈狀肉芽腫（mycosis fungoides）
B. 脂漏性角化症（seborrheic keratosis）
C. 傳染性軟疣（molluscum contagiosum）
D. 病毒疣（viral wart）

正確答案：A. 蕈狀肉芽腫（mycosis fungoides）